Clinical trial exclusion criterion:
Inflammatory bowel disease

Annotated entities:
- Condition: "Inflammatory bowel disease"